Clinical trial exclusion criterion:
COPD exacerbation, very severe COPD with hypoxemia at low altitude (FEV1/FVC <0.7, FEV1 <40% predicted, oxygen saturation on room air <92% at 750 m).

Entity relations:
- Has_qualifier("hypoxemia", "low altitude")
- AND("COPD", "hypoxemia")
- Has_qualifier("COPD", "very severe")
- Has_value("FEV1", "<40% predicted")
- Has_qualifier("oxygen saturation", "room air")
- Has_qualifier("oxygen saturation", "750 m")
- Has_value("oxygen saturation", "<92%")
- OR("COPD exacerbation", "COPD")